Clinical trial inclusion criteria:
patients with severe left ventricle dysfunction with an ejection fraction (EF)=40%, being scheduled for revascularization.

Annotated entities:
- Qualifier: "severe"
- Condition: "left ventricle dysfunction"
- Measurement: "ejection fraction (EF)"
- Value: "=40%"
- Mood: "being scheduled for"
- Procedure: "revascularization"